Known allergy or contraindication (relative or absolute) to progesterone therapy.

The above is a clinical trial exclusion criterion. Annotated with entity spans:
Known [Condition: allergy] or [Condition: contraindication] ([Qualifier: relative] or [Qualifier: absolute]) to [Procedure: progesterone therapy].